What is the most sensitive test for the diagnosis of multiple sclerosis?

These results support previous conclusions that MRI is the most sensitive test for detecting white matter asymptomatic lesions, and the most predictive for the diagnosis of CDMS.